Clinical trial exclusion criterion:
Non- English speakers

Annotated entities:
- Observation: "Non- English speakers"